下列何者不是形成滲漏型視網膜剝離（exudative retinal detachment）的主要原因？
A. 背景型糖尿病視網膜病變（background diabetic retinopathy）
B. 脈絡膜腫瘤（choroidal tumor）
C. 後鞏膜炎（posterior scleritis）
D. 原田氏病症（Harada's disease）

正確答案：A. 背景型糖尿病視網膜病變（background diabetic retinopathy）